Clinical trial exclusion criterion:
Diabetes insipidus

Annotated entities:
- Condition: "Diabetes insipidus"